70歲肺癌病人化學治療後，電腦斷層追蹤發現右上肺有3 cm的結節，切片手術病理報告為：Granulomatous inflammation、caseous necrosis、multinucleus giant cell，下列初步處置何者最不恰當？
A. 痰液結核菌抹片及結核菌培養
B. 病理切片進一步特殊染色，以判斷可能之致病菌
C. 進行隔離直到排除開放性結核
D. 立即給與amphotericin B治療

正確答案：D. 立即給與amphotericin B治療